DSM-IV or DSM-5 diagnosis of schizophrenia or schizoaffective disorder

The above is a clinical trial inclusion criterion. Annotated with entity spans:
[Qualifier: DSM-IV] or [Qualifier: DSM-5] diagnosis of [Condition: schizophrenia] or [Condition: schizoaffective disorder]